List types of cancer where TBC1 domain family member 16 (TBC1D16) is involved

TBC1D16 is a predictive marker for favorable prognosis of Epithelial ovarian cancer (EOC). In addition, a short isoform of TBC1D16 (TBC1D16-47KD) exacerbates melanoma growth and metastasis both in vitro and in vivo.